關於腦部動脈瘤的蜘蛛網膜下腔出血（SAH），下列何者錯誤？
A. 蜘蛛網膜下腔出血較集中處常與動脈瘤的位置有關
B. 蜘蛛網膜下腔出血所造成的腦血管收縮（vasospasm），通常在前三天最嚴重
C. 電腦斷層血管影像（CTA）在診斷大於2 mm的腦動脈瘤有超過90%的敏感度
D. 蜘蛛網膜下腔出血可造成交通性水腦（communicating hydrocephalus）

正確答案：B. 蜘蛛網膜下腔出血所造成的腦血管收縮（vasospasm），通常在前三天最嚴重